Other serious illness or medical conditions

The above is a clinical trial exclusion criterion. Annotated with entity spans:
Other [Condition: serious illness] or [Condition: medical conditions]